Clinical trial exclusion criterion:
secondary diabetes

Annotated entities:
- Qualifier: "secondary"
- Condition: "diabetes"